Clinical trial exclusion criterion:
Has any clinically significant condition or situation (eg, anatomical malformation that complicates intubation) other than the condition being studied that, in the opinion of the investigator, would interfere with the trial evaluations or optimal participation in the trial.

Annotated entities:
- Qualifier: "clinically significant"
- Condition: "condition"
- Observation: "situation"
- Qualifier: "anatomical malformation"
- Negation: "other than"
- Condition: "the condition being studied"
- Observation: "interfere with the trial evaluations"
- Observation: "interfere with optimal participation"